Clinical trial exclusion criterion:
16. Neuropsychiatric disorders/symptoms or psychological conditions.

Annotated entities:
- Parsing_Error: "16."
- Condition: "Neuropsychiatric disorders"
- Undefined_semantics: "Neuropsychiatric disorders"
- Condition: "psychological conditions"
- Condition: "Neuropsychiatric symptoms"
- Undefined_semantics: "Neuropsychiatric symptoms"
- Undefined_semantics: "psychological conditions"